Clinical trial exclusion criterion:
Active infectious endocarditis

Annotated entities:
- Qualifier: "Active"
- Condition: "infectious endocarditis"
- Temporal: "Active"